Clinical trial exclusion criterion:
Have osteoporosis

Annotated entities:
- Condition: "osteoporosis"